Drug abuse.

The above is a clinical trial exclusion criterion. Annotated with entity spans:
[Condition: Drug abuse].